Subjects have no history of the following: ongoing acute or intermittent pain, postoperative pain, respiratory compromise, acute or severe asthma, or constipation (less than 1 bowel movement every 2 days)

The above is a clinical trial inclusion criterion. Annotated with entity spans:
Subjects have [Negation: no] history of the following: ongoing [Qualifier: acute] or [Qualifier: intermittent] [Condition: pain], [Qualifier: postoperative] [Condition: pain], [Condition: respiratory compromise], [Qualifier: acute] or [Qualifier: severe] [Condition: asthma], or [Condition: constipation] (less than 1 bowel movement every 2 days)